Clinical trial inclusion criterion:
Are at least 18 years of age

Entity relations:
- Has_value("age", "at least 18 years")